Clinical trial inclusion criterion:
singleton, term pregnancy

Entity relations:
- Has_qualifier("pregnancy", "term")
- Has_qualifier("pregnancy", "singleton")